Clinical trial inclusion criteria:
Adult kidney transplant recipients > 18 y.o.
Kidney Transplant recipients, after the first episode of cytomegalovirus infection, using the current immunosuppressive regimen: azathioprine or mycophenolate, tacrolimus and prednisone.

Annotated entities:
- Procedure: "kidney transplant"
- Person: "Adult"
- Person: "y.o."
- Value: "> 18"
- Condition: "cytomegalovirus infection"
- Drug: "immunosuppressive regimen"
- Drug: "azathioprine"
- Drug: "mycophenolate"
- Drug: "tacrolimus"
- Drug: "prednisone"